Urinary tract anomaly

The above is a clinical trial exclusion criterion. Annotated with entity spans:
[Condition: Urinary tract anomaly]